在人類細胞中，DNA 複製（DNA replication）時是以何種物質為引子（primer）？
A. DNA
B. RNA
C. 蛋白質
D. 不需引子

正確答案：B. RNA